Clinical trial inclusion criterion:
Willing and able to provide written informed consent and accept study procedures and time schedule.

Annotated entities:
- Informed_consent: "Willing and able to provide written informed consent and accept study procedures and time schedule."